18 歲病患，高 160 公分，體重 48 公斤，至婦科求診，主訴無初經來潮，身體檢查乳房發育、陰毛發育正常，則最可能的診斷為：
A. 雄激素不敏感症
B. 卵巢衰竭症
C. 處女膜閉鎖症
D. 透納氏徵候群（45,X）

正確答案：C. 處女膜閉鎖症